下列何種藥物可用於治療失眠，而它是作用於 melatonin 的 receptor？
A. diphenhydramine
B. promethazine
C. ramelteon
D. cyproheptadine

正確答案：C. ramelteon